Clinical trial exclusion criterion:
Acutely burned patients

Annotated entities:
- Condition: "Acutely burned"